¿En cuál de las siguientes entidades NO está implicado el Virus de Epstein-Barr?
1. Mononucleosis infecciosa.
2. Linfoma de Burkitt.
3. Linfoma de células grandes B en pacientes inmunodeprimidos.
4. Carcinoma nasofaríngeo.
5. Carcinoma de cérvix.

Respuesta correcta: 5. Carcinoma de cérvix.